35 歲以前年輕人的急性副睪丸發炎主要是因為：
A. 經由性接觸傳染的尿道炎
B. 大腸桿菌的泌尿道感染
C. 結核菌的泌尿道感染
D. 金黃色葡萄球菌造成的包皮龜頭炎

正確答案：A. 經由性接觸傳染的尿道炎